La reacción de trans-2-buteno con ácido m-cloroperbenzoico (mCPBA) da:
1. Una mezcla de diastereoisómeros.
2. (R)-3-Cloroperbenzoato de 2-butilo.
3. cis-2,3-Dimetiloxaciclopropano.
4. trans-2,3-Dimetiloxaciclopropano.
5. ()-3-Cloroperbenzoato de 2-butilo.

Respuesta correcta: 4. trans-2,3-Dimetiloxaciclopropano.